Clinical trial exclusion criterion:
Patients receiving medications highly bound to plasma proteins eg. Warfarin.

Annotated entities:
- Drug: "medications highly bound to plasma proteins"
- Drug: "Warfarin"